La determinación en una mujer de 70 años de hematocrito 32 %, Hb 9,6 g/dL, VCM 85 fL (7099), hierro 25 microg/dL (37-145) y ferritina 350 ng/mL (15-150), es más sugestivo de:
1. Pérdida de sangre reciente por aparato digestivo.
2. Malabsorción intestinal.
3. Polimialgia reumática.
4. Talasemia minor.

Respuesta correcta: 3. Polimialgia reumática.